Clinical trial inclusion criterion:
Plaque psoriasis with =2% Body Surface Area (BSA) involvement (may include scalp involvement), PASI Score = 2, IGA mod 2011 score of 2 or greater (based on scale of 0-4)

Entity relations:
- Has_value("involvement", "=2% Body Surface Area (BSA)")
- Has_value("IGA mod 2011 score", "2 or greater")
- Has_value("PASI Score", "= 2")
- AND("Plaque psoriasis", "involvement")
- AND("Plaque psoriasis", "PASI Score")
- Has_qualifier("Plaque psoriasis", "scale of 0-4")
- OR("PASI Score", "IGA mod 2011 score")